Salivary Cortisol is a biomarker for what disease/syndrome/condition?

Salivary cortisone, as a biomarker for psychosocial stress, is associated with state anxiety and heart rate.